免疫球蛋白（Immunoglobulin, Ig）的分子結構中，那一個區域不會與抗原接觸？
A. CDR
B. Fc
C. VL
D. VH

正確答案：B. Fc